下列何種癌症對化學治療反應最差？
A. 急性骨髓性白血病
B. 腎臟細胞癌
C. 乳癌
D. 精原細胞癌

正確答案：B. 腎臟細胞癌